黃太太 62 歲，罹患第2 型糖尿病5 年。身高163 公分、體重64.5 公斤。飲食正常，每日攝取1,600 Kcal，每天運動約四十分，服用 Glibenclamide 10 mg BID 及 Metformin 1,000 mg BID。最近半年的糖化血色素（HbA1C）分別為 7.8%及 8.2%，最近 1 個月自測空腹血糖為 98-120 mg/dL，飯後血糖為 218-250 mg/dL。 以下敘述何者錯誤？
A. 自測空腹血糖值大多數落於治療目標範圍內
B. HbA1C值的升高和基礎胰島素（basal insulin）分泌不足有關
C. 本病人可併用中效或長效胰島素治療
D. 本病人應將治療重點放在餐後血糖調控上

正確答案：B. HbA1C值的升高和基礎胰島素（basal insulin）分泌不足有關